Clinical trial inclusion criterion:
2. History of traumatic brain injury of sufficient severity to have resulted in medical attention (ascertained via the Ohio State University TBI Identification Questionnaire—OSU TBI-ID, and based on DoD/VA criteria)

Entity relations:
- Has_value("Ohio State University TBI Identification Questionnaire—OSU TBI-ID", "sufficient severity")
- Has_qualifier("traumatic brain injury", "sufficient severity")
- AND("traumatic brain injury", "Ohio State University TBI Identification Questionnaire—OSU TBI-ID")
- Has_temporal("traumatic brain injury", "History")